Clinical trial exclusion criterion:
Medical history of personal drug or alcohol addiction or abuse

Annotated entities:
- Condition: "addiction"
- Condition: "abuse"
- Qualifier: "alcohol"
- Qualifier: "drug"